Clinical trial exclusion criterion:
Patients with uncontrolled cancer;

Entity relations:
- Has_qualifier("cancer", "uncontrolled")